有關脊椎滑脫症（spondylolisthesis）引起疼痛、滑脫惡化及身體變形的危險因子，下列何者除外？
A. 年紀較輕
B. 男性病人
C. 反覆發作
D. 大腿後側肌群過緊

正確答案：B. 男性病人